Infertile women with eugonadotrophic anovulation/oligoovulation.

The above is a clinical trial inclusion criterion. Annotated with entity spans:
[Condition: Infertile] [Person: women] with [Qualifier: eugonadotrophic] [Condition: anovulation]/[Condition: oligoovulation].